有關腺病毒（adenovirus）的敘述，下列何者正確？
A. 病毒蛋白質E6和E7會抑制p53的作用
B. 感染上皮細胞，會在細胞核內形成包涵體（inclusion body）
C. 具有線型雙股DNA，並含有外	膜（envelope）
D. 在淋巴組織造成溶解性感染（lytic infection）

正確答案：B. 感染上皮細胞，會在細胞核內形成包涵體（inclusion body）